Clinical trial exclusion criterion:
Known intolerance or contraindication to ticagrelor or ASA

Entity relations:
- AND("intolerance", "ticagrelor")
- OR("ticagrelor", "ASA")
- OR("intolerance", "contraindication")